Subject with uncontrolled atrial fibrillation/flutter at screening (defined as ventricular response rate = 100 bpm)

The above is a clinical trial exclusion criterion. Annotated with entity spans:
Subject with [Qualifier: uncontrolled] [Condition: atrial fibrillation]/flutter [Temporal: at screening] (defined as [Measurement: ventricular response rate] [Value: = 100 bpm])